preexisting CNS depression, or taking regularly medication that cause CNS depression

The above is a clinical trial exclusion criterion. Annotated with entity spans:
preexisting [Condition: CNS depression], or taking regularly [Drug: medication] that cause [Condition: CNS depression]